Patients on chronic statin treatment (>30 days) scheduled for isolated CABG, including on- or off-pump or repeat (redo's) revascularisation procedures

The above is a clinical trial inclusion criterion. Annotated with entity spans:
Patients on [Multiplier: chronic] [Drug: statin] [Procedure: treatment] ([Value: >30 days]) [Mood: scheduled] for [Qualifier: isolated] [Procedure: CABG], including [Qualifier: on- or off-pump or repeat] ([Qualifier: redo's]) [Procedure: revascularisation procedures]